Receiving drugs acting primarily on the central nervous system, which lower the seizure threshold (see appendix 2)

The above is a clinical trial exclusion criterion. Annotated with entity spans:
Receiving [Drug: drugs acting primarily on the central nervous system], which [Qualifier: lower the seizure threshold] (see appendix 2)